Clinical trial exclusion criterion:
6. Incomplete colonoscopy due to causes except poor bowel preparation

Annotated entities:
- Parsing_Error: "6."
- Procedure: "colonoscopy"
- Condition: "poor bowel preparation"
- Negation: "except"
- Qualifier: "Incomplete"